Clinical trial inclusion criterion:
History of MDR gram-negative infection or sepsis due to organisms sensitive to colistin.

Annotated entities:
- Qualifier: "MDR"
- Condition: "gram-negative infection"
- Condition: "sepsis"
- Qualifier: "sensitive to colistin"
- Observation: "organisms"